肝臟左右葉區分，大致以 Cantlie's line 為分界，下列何者約略在此分界面上？
A. Left portal vein
B. Middle hepatic vein
C. Umbilical fissure
D. Right hepatic vein

正確答案：B. Middle hepatic vein